Skin and perineal disease with risk of infection

The above is a clinical trial exclusion criterion. Annotated with entity spans:
[Condition: Skin] [Parsing_Error: and] [Condition: perineal disease] with [Observation: risk of infection]